Al valorar el método anticonceptivo más adecuado para una persona hay que tener en cuenta:
1. El índice de Pearl que refleja el porcentaje de no embarazos de un método anticonceptivo en relación con el número de ciclos de utilización de dicho método.
2. La aceptabilidad del método que viene determinada por la ausencia de defectos colaterales.
3. La inocuidad del método que viene determinada por la ausencia de riesgos de salud que su utilización puede conllevar.
4. La motivación o condicionamientos socioculturales como el nivel de educación.
5. La reversibilidad o posibilidades quirúrgicas de recuperar la fertilidad tras la utilización del método.

Respuesta correcta: 3. La inocuidad del método que viene determinada por la ausencia de riesgos de salud que su utilización puede conllevar.